Un paciente de 25 años, durante un partido de tenis, tiene dolor intenso en el cuello y en el ojo izquierdo. La mañana siguiente se despierta con sensación de inestabilidad de la marcha y tiene ptosis palpebral del ojo izquierdo y anisocoria, siendo la pupila izquierda más pequeña que la derecha. El paciente mantiene buena agudeza visual. ¿Dónde localizaría con más probabilidad la lesión?
1. III par craneal.
2. Quiasma óptico.
3. Ganglio cervical superior.
4. Bulbo raquídeo.

Respuesta correcta: 4. Bulbo raquídeo.